Clinical trial exclusion criterion:
Patients with an absolute body weight of less than 41 kilograms (90.4 lbs) at baseline visit;

Entity relations:
- Subsumes("less than 41 kilograms", "90.4 lbs")
- Has_value("body weight", "less than 41 kilograms")